Which company developed opdivo?

Opdivo or nivolumab was developed by Bristol-Myers Squibb.